Clinical trial exclusion criterion:
Age less than 10 years or greater than 55 years, at time of consent

Annotated entities:
- Person: "Age"
- Value: "less than 10 years"
- Value: "greater than 55 years"
- Temporal: "at time of consent"
- Observation: "consent"
- Reference_point: "consent"